Clinical trial exclusion criterion:
The patient has a history of aspirin allergy

Entity relations:
- AND("allergy", "aspirin")
- Has_temporal("allergy", "history of")